En el riñón, la estimulación simpática aumenta:
1. La excreción renal de sodio.
2. La excreción renal de agua.
3. El radio de la arteriola aferente.
4. La filtración glomerular.
5. La liberación de renina.

Respuesta correcta: 5. La liberación de renina.